下列何者允許細胞間離子的進出？
A. 緊密接合（tight junctions）
B. 間隙接合（gap junctions）
C. 胞橋小體（desmosomes）
D. 黏著小帶（zonula adherens）

正確答案：B. 間隙接合（gap junctions）